下列何者並非針對單一器官的自體免疫疾病？
A. 格雷武司氏病（Graves' disease）
B. 全身性紅斑性狼瘡（systemic lupus erythematosus）
C. 重症肌無力（myasthenia gravis）
D. 多發性硬化症（multiple sclerosis）

正確答案：B. 全身性紅斑性狼瘡（systemic lupus erythematosus）